Clinical trial exclusion criterion:
Type 1 diabetes mellitus

Annotated entities:
- Condition: "Type 1 diabetes mellitus"